Clinical trial exclusion criterion:
Pregnant/lactating

Annotated entities:
- Condition: "Pregnant"
- Condition: "lactating"